Clinical trial exclusion criterion:
The patients receiving vitamin supplements or who had clinical evidence for an acute illness, renal dysfunction, thyroid dysfunction, chronic inflammatory diseases, inborn errors of homocysteine, cobalamin or folate metabolism, or any other condition known to interfere with homocysteine metabolism will be excluded

Entity relations:
- AND("clinical evidence for an acute illness", "acute illness")
- OR("vitamin supplements", "clinical evidence for an acute illness", "renal dysfunction", "thyroid dysfunction", "chronic inflammatory diseases")
- OR("inborn errors of cobalamin metabolism", "inborn errors of folate metabolism", "condition known to interfere with homocysteine metabolism", "inborn errors of homocysteine metabolism")